Symptomatic GSV or SSV vein reflux > 0.5 seconds on colour Duplex

The above is a clinical trial inclusion criterion. Annotated with entity spans:
Symptomatic [Condition: GSV] or [Condition: SSV vein reflux] [Qualifier: > 0.5 seconds] on [Procedure: colour Duplex]